Incapability to give informed consent

The above is a clinical trial exclusion criterion. Annotated with entity spans:
[Informed_consent: Incapability to give informed consent]